Clinical trial exclusion criterion:
PROM

Annotated entities:
- Condition: "PROM"